關於皮膚與軟組織感染skin and soft tissue infections（SSTIs）之敘述，下列何者錯誤？
A. impetigo與necrotizing fascitis之致病菌可能是Staphylococcus aureus
B. methicillin-resistant S. aureus（MRSA）在SSTI的盛行率逐漸增加
C. MRSA在異位性皮膚炎患者形成菌落的機會高於正常人
D. MRSA引起的皮膚與軟組織感染，多發生在醫療機構工作人員或住院病患，很少發生於一般社區正常人

正確答案：D. MRSA引起的皮膚與軟組織感染，多發生在醫療機構工作人員或住院病患，很少發生於一般社區正常人